有關非去極性肌肉鬆弛劑（Non-depolarizing muscle relaxants）的藥理特性，何者錯誤？
A. 低體溫（Hypothermia）延長其作用時間
B. 呼吸性酸中毒（Respiratory acidosis）強化其阻斷效果
C. 低血鈣（Hypocalcemia）強化其阻斷效果
D. 病人合併使用吸入性麻醉劑將增加對該藥物之需求劑量

正確答案：D. 病人合併使用吸入性麻醉劑將增加對該藥物之需求劑量